Clinical trial exclusion criterion:
2. Screening tool: Medical assessments (urine pregnancy test) at the beginning of each visit that involves TMS or MRI.

Entity relations:
- Subsumes("Medical assessments", "urine pregnancy test")
- Has_index("at the beginning of each visit", "the beginning of each visit")
- Has_temporal("Medical assessments", "at the beginning of each visit")
- AND("Medical assessments", "TMS")
- OR("TMS", "MRI")